下列有關蛋白質結構的敘述，何者正確？
A. mRNA的選擇性剪切（alternative splicing）不會影響蛋白質的一級結構
B. 點突變（point mutation）不會導致蛋白質二級結構的改變
C. β-摺板（β-sheet）與α-螺旋（α-helix）在蛋白質結構分類上屬於三級結構
D. 某些蛋白質可能以一種以上的四級結構存在

正確答案：D. 某些蛋白質可能以一種以上的四級結構存在